inability to walk independently for at least 10 minutes, with or without walking devices;

The above is a clinical trial exclusion criterion. Annotated with entity spans:
[Condition: inability to walk independently] for [Qualifier: at least 10 minutes], with or without [Device: walking devices];